Person is walking on average 1km/day.

The above is a clinical trial inclusion criterion. Annotated with entity spans:
Person is [Observation: walking] on average [Multiplier: 1km/day].